Neoadjuvant therapy for current breast cancer diagnosis

The above is a clinical trial exclusion criterion. Annotated with entity spans:
[Procedure: Neoadjuvant therapy] for current [Condition: breast cancer] diagnosis